Epileptiform EEG

The above is a clinical trial exclusion criterion. Annotated with entity spans:
[Value: Epileptiform] [Measurement: EEG]